Clinical trial inclusion criterion:
ANC = 1.5 × 109 / L

Annotated entities:
- Measurement: "ANC"
- Value: "= 1.5 × 109 / L"